Clinical trial exclusion criterion:
Vaginal bleeding.

Annotated entities:
- Condition: "Vaginal bleeding"